Clinical trial exclusion criterion:
acutely sick (for example, crying, wheezing, bleeding, screaming or shaken)

Entity relations:
- Subsumes("acutely sick", "crying")
- OR("crying", "screaming", "bleeding", "wheezing", "shaken")